El síndrome glomerulonefrítico cursa con:
1. Oliguria y hematuria.
2. Poliuria y deshidratación.
3. Pérdida de sodio por la orina.
4. Trombosis e infecciones.
5. Pérdida de glucosa por la orina.

Respuesta correcta: 1. Oliguria y hematuria.